HAs of any kind of moderate or severe intensity on an average of more than 2 days per month preceding the concussive trauma

The above is a clinical trial exclusion criterion. Annotated with entity spans:
[Condition: HAs] of any kind of [Qualifier: moderate or severe intensity] on an [Multiplier: average of more than 2 days per month] [Temporal: preceding the concussive trauma]